Carbapenemase-producing gram-negative bacteria is a major health concern because their resistance to antibiotics.
List the most frequent carbapenemases found in Enterobacteriaceae.

The most frequent carbapenemases in Enterobacteriaceae  are OXA-48, KPC, VIM, NDM, IMP, SME, NMC, GES, IMI and MBL.